Clinical trial exclusion criterion:
Focal laser photocoagulation or intravitreal/periocular steroids of any type in the study eye within the last 90 days prior to study enrollment.

Entity relations:
- Has_index("within the last 90 days prior to study enrollment", "study enrollment")
- Has_qualifier("Focal laser photocoagulation", "in the study eye")
- Has_temporal("Focal laser photocoagulation", "within the last 90 days prior to study enrollment")
- OR("Focal laser photocoagulation", "intravitreal/periocular steroids")